Clinical trial exclusion criterion:
Inability or unwillingness to complete questionnaires

Entity relations:
- OR("Inability to complete questionnaires", "unwillingness to complete questionnaires")